下列何者在胚胎早期發育中最晚出現？
A. 羊膜（amnion）
B. 卵黃囊（yolk sac）
C. 初級絨毛（primary chorionic villus）
D. 原條（primitive streak）

正確答案：D. 原條（primitive streak）